Clinical trial exclusion criteria:
Subjects with known intolerance to blood products or to one of the components of the study product or is unwilling to receive blood products;
Female subjects, who are of childbearing age (i.e. adolescent), who are pregnant or nursing;
Subject is currently participating or plans to participate in any other investigational device or drug without prior approval from the Sponsor;
Subjects who are known, current alcohol and/or drug abusers
Subjects admitted for trauma surgery
Subjects with any pre or intra-operative findings identified by the surgeon that may preclude conduct of the study procedure.
Subject with TBS in an actively infected field (Class III Contaminated or Class IV Dirty or Infected)
TBS is from large defects in arteries or veins where the injured vascular wall requires repair with maintenance of vessel patency and which would result in persistent exposure of the EVARREST™ or SURGICEL® to blood flow and pressure during healing and absorption of the product;
TBS with major arterial bleeding requiring suture or mechanical ligation;
Bleeding site is in, around, or in proximity to foramina in bone, or areas of bony confine.

Annotated entities:
- Condition: "intolerance"
- Procedure: "blood products"
- Non-query-able: "to one of the components of the study product or is unwilling to receive blood products"
- Pregnancy_considerations: "Female subjects, who are of childbearing age (i.e. adolescent), who are pregnant or nursing"
- Post-eligibility: "Subject is currently participating or plans to participate in any other investigational device or drug without prior approval from the Sponsor"
- Person: "drug abusers"
- Person: "alcohol abusers"
- Procedure: "trauma surgery"
- Non-query-able: "Subjects with any pre or intra-operative findings identified by the surgeon that may preclude conduct of the study procedure"
- Condition: "TBS"
- Qualifier: "Class III Contaminated"
- Qualifier: "Class IV Dirty or Infected"
- Non-query-able: "TBS is from large defects in arteries or veins where the injured vascular wall requires repair with maintenance of vessel patency and which would result in persistent exposure of the EVARREST™ or SURGICEL® to blood flow and pressure during healing and absorption of the produc"
- Condition: "TBS"
- Condition: "major arterial bleeding"
- Procedure: "mechanical ligation"
- Procedure: "suture"
- Non-query-able: "Bleeding site is in, around, or in proximity to foramina in bone, or areas of bony confine"